Clinical trial inclusion criterion:
Approved clinical indication for pectoral pacemaker exchange (e.g. elective replacement indication (ERI), end of service (EOS))

Entity relations:
- AND("clinical indication", "pectoral pacemaker exchange")
- Subsumes("clinical indication", "elective replacement indication (ERI)")
- OR("elective replacement indication (ERI)", "end of service (EOS)")